Clinical trial exclusion criterion:
Infection with hepatitis B virus (HBV) or human immunodeficiency virus (HIV)

Entity relations:
- OR("hepatitis B virus (HBV)", "human immunodeficiency virus (HIV)")